Acute angle closure glaucoma is suspected

The above is a clinical trial exclusion criterion. Annotated with entity spans:
[Condition: Acute angle closure glaucoma] is [Mood: suspected]